正常年輕男性直立解剖位置，體表標記（landmark）與體內構造之配對，下列何者正確？
A. 頸靜脈切跡（jugular notch）水平面：C7椎骨
B. 胸骨角（sternal angle）水平面：T2椎骨
C. 劍胸關節（xiphisternal joint）水平面：T9椎骨
D. 男性乳頭：前方第6肋間

正確答案：C. 劍胸關節（xiphisternal joint）水平面：T9椎骨